Al centrifugar sangre periférica humana en un gradiente de densidad en Ficoll:
1. Las células mononucleares flotan sobre el Ficoll.
2. Los linfocitos quedan en el fondo.
3. Los eritrocitos flotan sobre el Ficoll.
4. Los granulocitos flotan sobre el Ficoll.
5. Los monocitos quedan en el fondo.

Respuesta correcta: 1. Las células mononucleares flotan sobre el Ficoll.